Clinical trial exclusion criterion:
Contraindication to azithromycin use and other prophylactic antibiotic use

Entity relations:
- Has_qualifier("prophylactic antibiotic use", "other")
- AND("Contraindication", "azithromycin")
- AND("Contraindication", "prophylactic antibiotic use")